Clinical trial exclusion criterion:
any history of stroke, transient ischemic attack (TIA), instable angina pectoris or myocardial infarction within last 3 months prior to baseline visit

Entity relations:
- Has_index("last 3 months prior to baseline visit", "baseline visit")
- Subsumes("transient ischemic attack", "TIA")
- Has_qualifier("angina pectoris", "instable")
- Has_temporal("stroke", "last 3 months prior to baseline visit")
- OR("stroke", "transient ischemic attack", "angina pectoris", "myocardial infarction")